Subjects who are able and willing to undergo elective cardiac magnetic resonance (MR) scanning without sedation (MRI-group)

The above is a clinical trial inclusion criterion. Annotated with entity spans:
Subjects who are able and [Mood: willing to undergo] [Qualifier: elective] [Procedure: cardiac magnetic resonance] ([Procedure: MR]) scanning [Qualifier: without sedation] (MRI-group)